Clinical trial exclusion criterion:
Presence of ocular or systemic disease or need of medications which might interfere with contact lens wear.

Annotated entities:
- Condition: "systemic disease"
- Condition: "ocular disease"
- Condition: "need of medications"
- Undefined_semantics: "need of medications"
- Subjective_judgement: "need of medications"
- Undefined_semantics: "ocular or systemic disease"
- Qualifier: "might interfere with contact lens wear"
- Subjective_judgement: "might interfere with contact lens wear"